Clinical trial exclusion criterion:
Previous vaccination against diphtheria, tetanus, pertussis, polio, hepatitis B, Haemophilus influenzae type b, and/or S. pneumoniae with the exception of vaccines where the first dose can be given within the first two weeks of life according to the national recommendations

Annotated entities:
- Drug: "vaccination"
- Condition: "diphtheria"
- Condition: "tetanus"
- Condition: "pertussis"
- Condition: "polio"
- Condition: "hepatitis B"
- Condition: "Haemophilus influenzae type b"
- Condition: "S. pneumoniae"
- Temporal: "within the first two weeks of life"
- Qualifier: "first dose can be given"
- Drug: "vaccines"
- Negation: "with the exception of"
- Reference_point: "the first two weeks of life"